Clinical trial inclusion criterion:
Have experienced at least 2 moderate or severe COPD exacerbations leading to medical consultation (requiring oral corticosteroids or increasing dosage of oral corticosteroids and/or antibiotics or hospitalization) within the 12 months preceding Visit 1.

Entity relations:
- Has_qualifier("COPD exacerbations", "moderate")
- Has_multiplier("COPD exacerbations", "at least 2")
- Has_qualifier("oral corticosteroids", "increasing dosage")
- AND("COPD exacerbations", "oral corticosteroids")
- Has_temporal("COPD exacerbations", "within the 12 months preceding Visit 1")
- OR("moderate", "severe")
- OR("oral corticosteroids", "hospitalization", "oral corticosteroids", "antibiotics")